Clinical trial exclusion criterion:
Use of antidepressant medications or other psychotropic medications in the last 4 weeks (or the last 6 weeks for fluoxetine). Occasional use of benzodiazepines or non-benzodiazepine sedatives (such as zolpidem, eszopiclone, or zaleplon) during this period is allowable.

Entity relations:
- Has_qualifier("psychotropic medications", "other")
- AND("in the last 6 weeks", "fluoxetine")
- Has_temporal("antidepressant medications", "in the last 4 weeks")
- Subsumes("benzodiazepines sedatives", "zolpidem")
- Has_negation("benzodiazepines sedatives", "is allowable")
- Has_multiplier("benzodiazepines sedatives", "Occasional use")
- OR("antidepressant medications", "psychotropic medications")
- OR("in the last 4 weeks", "in the last 6 weeks")
- OR("zolpidem", "eszopiclone", "zaleplon")
- OR("benzodiazepines sedatives", "non-benzodiazepine sedatives")